permit or license to drive

The above is a clinical trial inclusion criterion. Annotated with entity spans:
[Observation: permit] or [Observation: license to drive]